Clinical trial inclusion criterion:
scheduled to receive ISB and general anesthesia as a day surgery patient for rotator cuff repair and acromioplasty, as a part of planned routine care

Entity relations:
- Has_qualifier("rotator cuff repair", "day surgery")
- AND("rotator cuff repair", "ISB")
- Has_qualifier("acromioplasty", "day surgery")
- AND("rotator cuff repair", "acromioplasty")
- AND("ISB", "general anesthesia")